Clinical trial exclusion criterion:
Stroke or coronary revascularization in the past 6 months.

Entity relations:
- Has_temporal("Stroke revascularization", "in the past 6 months")
- OR("Stroke revascularization", "coronary revascularization")